Immune disease

The above is a clinical trial exclusion criterion. Annotated with entity spans:
[Condition: Immune disease]